Clinical trial inclusion criterion:
HCV RNA level at most 6 months prior to the Baseline/Day 1 visit.

Annotated entities:
- Measurement: "HCV RNA level"
- Temporal: "at most 6 months prior to the Baseline/Day 1 visit"
- Reference_point: "the Baseline/Day 1 visit"